Clinical trial exclusion criteria:
Unable to read and understand the Danish language or to give informed consent
Cervical dilatation > 4 cm
Non-cephalic presentation
Multiple gestation
Pathological fetal heart rate pattern (cardiotocogram, CTG) before Syntocinon® initiation
Fetal weight estimation > 4500 g (clinical or ultrasonic)
Subject declines participation
Gestational age less than 37 completed weeks

Annotated entities:
- Observation: "Unable to read"
- Observation: "Unable to understand the Danish language"
- Observation: "Unable to give informed consent"
- Measurement: "Cervical dilatation"
- Value: "> 4 cm"
- Condition: "Non-cephalic presentation"
- Condition: "Multiple gestation"
- Condition: "Pathological fetal heart rate pattern"
- Procedure: "cardiotocogram"
- Procedure: "CTG"
- Temporal: "before Syntocinon® initiation"
- Drug: "Syntocinon®"
- Reference_point: "Syntocinon® initiation"
- Measurement: "Fetal weight estimation"
- Value: "> 4500 g"
- Qualifier: "clinical"
- Procedure: "ultrasonic"
- Informed_consent: "Subject declines participation"
- Measurement: "Gestational age"
- Value: "less than 37 completed weeks"